Clinical trial exclusion criterion:
Use of corticosteroids/other antithrombotic agents(warfarin)

Entity relations:
- Subsumes("antithrombotic agents", "warfarin")
- OR("corticosteroids", "antithrombotic agents")